一位43歲女性病人有頭暈和嘔吐的現象已經三日，經檢查懷疑是良性陣發性眩暈（benign paroxysmal positional vertigo），下列何種檢查最適合用來確定診斷？
A. Dix-Hallpike position test檢查
B. 腦波檢查（electroencephalography）
C. 腦部電腦斷層（brain CT scan）
D. 頸動脈超音波（carotid ultrasound）

正確答案：A. Dix-Hallpike position test檢查